Clinical trial exclusion criterion:
A positive test for Human Immunodeficiency Virus (HIV) antibody.

Annotated entities:
- Measurement: "Human Immunodeficiency Virus (HIV) antibody"
- Value: "positive"